Clinical trial inclusion criterion:
HbA1c =6.5%

Annotated entities:
- Measurement: "HbA1c"
- Value: "=6.5%"